下列關於弓蟲（Toxoplasma gondii）的敘述，何者錯誤？
A. 子宮內感染可能造成胎兒水腦症
B. 人是其終宿主，而貓是其中間宿主
C. 弓蟲症可以用 pyrimethamine-trisulfapyrimidines 治療
D. 在愛滋病患者可能引起弓蟲性腦炎

正確答案：B. 人是其終宿主，而貓是其中間宿主